Clinical trial inclusion criterion:
After half-dose ticagrelor (loading dose 90mg, and then 45mg bidpo.) treatment for 3 days, the platelet aggregation is effectively inhibited by light transmission aggregometry method and thromboela-stogram.

Entity relations:
- Has_value("loading dose", "90mg")
- Subsumes("half-dose", "loading dose")
- Has_multiplier("ticagrelor", "half-dose")
- Has_temporal("ticagrelor", "treatment for 3 days")
- Has_value("platelet aggregation", "inhibited")
- Has_qualifier("inhibited", "effectively")
- AND("platelet aggregation", "light transmission aggregometry")
- Subsumes("half-dose", "45mg bidpo.")
- AND("platelet aggregation", "thromboela-stogram")